一位85歲血尿患者被診斷出膀胱原位癌（carcinoma in situ，CIS），若患者拒絕進行radical cystectomy，則下列何種膀胱內藥物灌注治療最能有效控制此症？
A. Bacillus Calmette-Guerin（BCG）
B. mitomycin C
C. doxorubicin
D. gemcitabine

正確答案：A. Bacillus Calmette-Guerin（BCG）